What percentage of human genes have no introns?

Intronless genes (IGs) constitute approximately 3% of the human genome. Intronless genes, which constitute 3 percent of the human genome, differ from intron-containing genes in evolution and function.